下列有關慢性非癌症疼痛的多重治療方式之敘述，何者錯誤？
A. 心理醫師的行為治療可幫助下背痛病患
B. 復健對慢性非癌症疼痛而言，主動運動較被動按摩效果較佳
C. 職能治療對疼痛治療也有幫助
D. 麻醉醫師就只是利用神經阻斷與藥物來治療病人

正確答案：D. 麻醉醫師就只是利用神經阻斷與藥物來治療病人